Los Criterios Diagnósticos de Investigación (CIE- 10) para la crisis de angustia:
1. Son idénticos al DSM-IV, no hay variación.
2. Son idénticos a los del DSM-IV, excepto que la CIE-10 incluye la boca seca y exige que, al menos uno de los síntomas presentes, sea palpitaciones, sudoración, temblores o boca seca.
3. Difieren en su totalidad al de los del DSM-IV.
4. Los Criterios Diagnósticos de la CIE- 10 no requieren la aparición de un mínimo de crisis.
5. Los Criterios Diagnósticos de la CIE- 10 no requieren un periodo de duración.

Respuesta correcta: 2. Son idénticos a los del DSM-IV, excepto que la CIE-10 incluye la boca seca y exige que, al menos uno de los síntomas presentes, sea palpitaciones, sudoración, temblores o boca seca.